SCH (TSH: upper limits of normal (ULN) -10mIU/L, and FT4 level within reference range).

The above is a clinical trial inclusion criterion. Annotated with entity spans:
[Condition: SCH] ([Measurement: TSH]: [Value: upper limits of normal (ULN) -10mIU/L], and [Measurement: FT4 level] [Value: within reference range]).